Clinical trial exclusion criterion:
Have a life expectancy of less than three months

Entity relations:
- Has_value("life expectancy", "less than three months")